Clinical trial inclusion criterion:
Weight at least 45 kg

Annotated entities:
- Measurement: "Weight"
- Value: "at least 45 kg"